Clinical trial exclusion criteria:
any neurological conditions other than PD;
significant musculoskeletal or cardiopulmonary diseases;
other disorders that may affect balance or locomotion;
taken any structured behavioral or exercise programs in the past 3 months
or they are receiving regular physical rehabilitation at present;
unstable condition on anti-parkinsonian medications;
surgical interventions for PD;
communication or cognitive deficits with mini-mental state examination, (MMSE) <24/30 (Folstein et al., 1975);
a history of more than two falls in the previous 12 months.

Annotated entities:
- Condition: "neurological conditions"
- Condition: "PD"
- Negation: "other than"
- Condition: "cardiopulmonary diseases"
- Condition: "musculoskeletal diseases"
- Qualifier: "significant"
- Subjective_judgement: "significant"
- Undefined_semantics: "significant"
- Condition: "disorders that may affect balance or locomotion"
- Undefined_semantics: "disorders that may affect balance or locomotion"
- Procedure: "structured exercise programs"
- Procedure: "structured behavioral programs"
- Temporal: "in the past 3 months"
- Procedure: "regular physical rehabilitation"
- Temporal: "at present"
- Condition: "unstable condition"
- Drug: "anti-parkinsonian medications"
- Undefined_semantics: "unstable condition on anti-parkinsonian medications"
- Procedure: "surgical interventions for PD"
- Condition: "PD"
- Condition: "cognitive deficits"
- Measurement: "mini-mental state examination, (MMSE)"
- Value: "<24/30"
- Condition: "communication deficits"
- Multiplier: "more than two"
- Condition: "falls"
- Temporal: "in the previous 12 months"
- Temporal: "history"